List the off-label use of SSRIs

depression during childhood and adolescence
Premature ejaculation (PE)
erectile dysfunction
Insomnia
postprostatectomy established stress urinary incontinence.
mood and anxiety disorders during pregnancy and breast feeding
symptoms of vasomotor dysregulation (hot flashes) associated with the menopausal transition and sex hormone deprivation
..off-label uses include the treatment of bulimia, benzodiazepine/alcohol dependence, fibromyalgia, central nervous system degenerative diseases (behavioral disorders in dementia and other organic disorders), schizophrenia, chronic pain disease and diabetic neuropathy, sexual dysfunction.